Clinical trial inclusion criterion:
Confirmed diagnosis of non-Burkitt B-lineage ALL

Entity relations:
- Has_qualifier("non-Burkitt B-lineage ALL", "Confirmed")